Clinical trial inclusion criterion:
Apgar score at 5 minutes >7

Annotated entities:
- Measurement: "Apgar score"
- Value: ">7"
- Temporal: "at 5 minutes"